Which extra thyroid tissues have thyrotropin (TSH) receptors?

TSH receptors are expressed also in extrathyroid tissues. TSH receptors seem to be functional. Extrathyroid tissues include fibrobasts of the orbit and adipose tissue
The principal tissues with TSH receptors are:
adippose tissue
 orbital fibrotic tissue